Clinical trial inclusion criterion:
Scheduled for gynecological laparoscopic surgery

Entity relations:
- Has_mood("laparoscopic surgery", "Scheduled")
- Has_qualifier("laparoscopic surgery", "gynecological")